Clinical trial inclusion criterion:
• Inflammatory back pain

Annotated entities:
- Condition: "Inflammatory back pain"